Clinical trial inclusion criterion:
undergoing elective posterior spine multi-level instrumentation surgery

Annotated entities:
- Temporal: "undergoing"
- Qualifier: "elective"
- Qualifier: "posterior spine"
- Procedure: "multi-level instrumentation surgery"